day 3 transfers

The above is a clinical trial exclusion criterion. Annotated with entity spans:
[Non-query-able: day 3 transfers]